What is promoted by ERAP1-ERAP2 dimerization?

ERAP1-ERAP2 dimerization increases peptide-trimming efficiency.